History of anti-vascular endothelial growth factor treatment in the past 12 months

The above is a clinical trial exclusion criterion. Annotated with entity spans:
History of [Drug: anti-vascular endothelial growth factor] treatment [Temporal: in the past 12 months]